Patient who undergoing gynecologic laparoscopic surgery

The above is a clinical trial inclusion criterion. Annotated with entity spans:
Patient who undergoing [Procedure: gynecologic laparoscopic surgery]